List R packages for lipidomics

R packages for lipidomics: lipidomics, masspix, lipidms, lipidr and lipid mini-on.